Hombre de 32 años de edad sin antecedentes de interés ni factores de riesgo cardiovascular. Clínica de disnea al subir un piso de escaleras de 1 mes de evolución. Consulta por síncope brusco precedido de esfuerzo. Antecedentes familiares de muerte no explicada de forma brusca en su hermano. En la exploración física destaca un soplo sistólico rudo más audible en foco aórtico. El electrocardiograma practicado en consulta muestra un ritmo sinusal con patrón compatible de hipertrofia de ventricular izquierda. Se realiza un ecocardiograma que documenta una importante hipertrofia asimétrica de septo interventricular con un gradiente dinámico subvalvular de 70 mmHg con insuficiencia mitral secundaria moderada y fracción de eyección de ventrículo izquierdo conservada. ¿Qué opción terapéutica es la MENOS indicada?
1. Beta-bloqueantes.
2. Digoxina.
3. Calcio-antagonistas no dihidropiridínicos.
4. Desfibrilador automático implantable.
5. Miomectomía septal quirúrgica de Morrow.

Respuesta correcta: 2. Digoxina.